Clinical trial exclusion criterion:
Pregnant or nursing (lactating) women, where pregnancy is defined as the state of a female after conception and until the termination of gestation, confirmed by a positive hcG laboratory test.

Entity relations:
- Subsumes("nursing", "lactating")
- Has_value("hcG laboratory test", "positive")
- Has_context("Pregnant", "hcG laboratory test")
- OR("Pregnant", "nursing")